What is the function of GFRAL?

GFRAL (orphan receptor of the glial-derived neurotrophic factor (GDNF) receptor α family) is a high-affinity receptor for GDF15.
GFRAL expression is limited to hindbrain neurons and not present in peripheral tissues, which suggests that GDF15-GFRAL-mediated regulation of food intake is by a central mechanism.